Clinical trial exclusion criteria:
Research exemption requested
History of PCV-13 vaccination
History of cochlear implant
Cerebrospinal Fluid (CSF) leak
Congestive Heart Failure (CHF)
Diabetes Mellitus (DM)
Chronic Kidney Disease (CKD)
Human Immunodeficiency Virus (HIV)
Common Variable Immune Deficiency (CVID)
Patients who have received the PPSV23 vaccine in the last 5 years
Women who are pregnant will also be excluded from the study by performing 2 point of care urine pregnancy tests ( prior to vaccinations)

Annotated entities:
- Observation: "Research exemption requested"
- Temporal: "History"
- Procedure: "PCV-13 vaccination"
- Temporal: "History"
- Device: "cochlear implant"
- Condition: "Cerebrospinal Fluid (CSF) leak"
- Condition: "Congestive Heart Failure (CHF)"
- Condition: "Diabetes Mellitus (DM)"
- Condition: "Chronic Kidney Disease (CKD)"
- Condition: "Human Immunodeficiency Virus (HIV)"
- Condition: "Common Variable Immune Deficiency (CVID)"
- Drug: "PPSV23 vaccine"
- Temporal: "in the last 5 years"
- Person: "Women"
- Condition: "pregnant"
- Procedure: "point of care urine pregnancy tests"
- Multiplier: "2"
- Temporal: "prior to vaccinations"
- Procedure: "vaccinations"
- Reference_point: "vaccinations"